Clinical trial exclusion criterion:
Patients with compromised renal.

Annotated entities:
- Condition: "compromised renal"